Clinical trial exclusion criterion:
Having the other contraindications for Rosuvastatin;

Entity relations:
- AND("contraindications", "Rosuvastatin")